Adult participants with low or intermediate-1 risk MDS

The above is a clinical trial inclusion criterion. Annotated with entity spans:
[Person: Adult] participants with [Value: low] or [Value: intermediate-1 risk] [Measurement: MDS]